Smokers, non-smokers or former-smokers

The above is a clinical trial inclusion criterion. Annotated with entity spans:
[Condition: Smokers], [Condition: non-smokers] or [Condition: former-smokers]